Subject unwilling or unable to comply with study procedures

The above is a clinical trial exclusion criterion. Annotated with entity spans:
[Non-query-able: Subject unwilling or unable to comply with study procedures]